Clinical trial exclusion criterion:
Diagnoses of mental retardation, dementia or delirium

Entity relations:
- OR("mental retardation", "dementia", "delirium")